Clinical trial inclusion criterion:
Histologically confirmed colorectal adenocarcinoma

Entity relations:
- Has_qualifier("colorectal adenocarcinoma", "Histologically confirmed")
- multi("Histologically confirmed", "Histologically")